Clinical trial inclusion criterion:
AB0 compatible transplant.

Entity relations:
- Has_qualifier("transplant", "AB0 compatible")